王先生於家中洗澡時不幸發生瓦斯氣爆，經救護車送至急診室，急診醫師身體檢查發現，燒傷範圍在兩側上肢、前胸及腹部深二度燒傷，於急診室測量體重為 60 公斤；請問依據"rule of nines"及 "Parkland formula"其燒傷面積為何？前 24 小時應如何給予輸液？
A. 36%；8640 mL 乳酸鹽林格氏液（lactated Ringer's solution）
B. 45%；10800 mL 乳酸鹽林格氏液（lactated Ringer's solution）
C. 36%；8640 mL 5%葡萄糖液（D5W）
D. 45%；10800 mL 5%葡萄糖液（D5W）

正確答案：A. 36%；8640 mL 乳酸鹽林格氏液（lactated Ringer's solution）